2. Screening tool: Medical assessments (urine pregnancy test) at the beginning of each visit that involves TMS or MRI.

The above is a clinical trial exclusion criterion. Annotated with entity spans:
[Parsing_Error: 2.] Screening tool: [Procedure: Medical assessments] ([Measurement: urine pregnancy test]) [Temporal: at the beginning of each visit] that involves [Procedure: TMS] or [Procedure: MRI].